Patients aged <18 years of age

The above is a clinical trial exclusion criterion. Annotated with entity spans:
Patients [Person: aged] [Value: <18 years of age]